Which tool exists for microsatellite (SSR) loci detection and primer design?

FullSSR is a new bioinformatic tool for microsatellite (SSR) loci detection and primer design using genomic data from NGS assay.